What is "cell competition"?

Cell competition is a social cellular phenomenon in which unfit cells are selectively eliminated to maintain tissue homeostasis.
At the initial stage of carcinogenesis, cell competition often occurs between newly emerging transformed cells and the neighboring normal cells, leading to the elimination of transformed cells from the epithelial layer.